En algunos tratamientos de muestra se utiliza la técnica de extracción en fase sólida. Dicha técnica:
1. Tiene la ventaja de que no se requieren disolventes.
2. Se aplica poniendo en contacto la muestra sólida con la fase estacionaria contenida en un cartucho.
3. No requiere la aplicación de presión ni de vacío.
4. Permite llevar a cabo la preconcentración de muestras de gran volumen.
5. Se caracteriza por el elevado consumo de disolventes.

Respuesta correcta: 4. Permite llevar a cabo la preconcentración de muestras de gran volumen.